Clinical trial exclusion criterion:
Chronic administration (defined as more than 14 days) of immunosuppressants or other immune-modifying drugs within six months prior to the first vaccine dose.

Entity relations:
- Subsumes("Chronic", "more than 14 days")
- Has_temporal("immunosuppressants", "Chronic")
- Has_temporal("immunosuppressants", "within six months")
- OR("immunosuppressants", "other immune-modifying drugs")